Clinical trial inclusion criterion:
Total bilirubin less than 1.5 x ULN. NOTE: If the potential participant is taking an indinavir (IDV)- or atazanavir (ATV)-containing regimen at the time of screening, total bilirubin less than or equal to 5 x ULN is acceptable.

Annotated entities:
- Measurement: "Total bilirubin"
- Value: "less than 1.5 x ULN"
- Drug: "indinavir (IDV)"
- Drug: "atazanavir (ATV)"
- Procedure: "regimen"
- Temporal: "at the time of screening"
- Measurement: "total bilirubin"
- Value: "less than or equal to 5 x ULN"